Clinical trial inclusion criterion:
Female subjects' serum pregnancy test performed at the screening visit and urine pregnancy test performed at the baseline visit must be negative.

Annotated entities:
- Pregnancy_considerations: "Female subjects' serum pregnancy test performed at the screening visit and urine pregnancy test performed at the baseline visit must be negative."